FEV1 value = 30-80%

The above is a clinical trial inclusion criterion. Annotated with entity spans:
[Measurement: FEV1 value] [Value: = 30-80%]